Clinical trial inclusion criterion:
Of either gender, aged ≥19 and ≤70 years

Entity relations:
- Has_value("aged", "≥19 and ≤70 years")